Estimula la ingesta de alimento:
1. Leptina.
2. Colescistocinina.
3. Neuropéptido Y.
4. Hormona estimulante del melanocito alfa (MSH-a).

Respuesta correcta: 3. Neuropéptido Y.